Clinical trial exclusion criterion:
In an emergency setting, or hospitalized involuntarily

Entity relations:
- Has_qualifier("hospitalized", "involuntarily")
- OR("emergency setting", "hospitalized involuntarily")